一位 30 歲男性，為長期靜脈毒癮者，因為發燒，呼吸困難來求診；心臟聽診有心雜音，且肺部 X 光有多處浸潤，請問最可能病原菌為何？
A. Klebsiella pneumoniae
B. Proteus mirabilis
C. Staphylococcus aureus
D. Streptococcus pyogenes

正確答案：C. Staphylococcus aureus